關於脈搏血氧飽和度分析，臨床使用上的限制，下列敘述何者錯誤？
A. 因為血氧飽和濃度也會受到血中二氧化碳濃度的影響，因此脈搏血氧飽和度分析也可用以監測通氣量（ventilation）是否足夠
B. 低體溫、低心輸出量（cardiac output）、以及藥物所引起的周邊血管收縮，都有可能影響
C. 病患肢體動作以及低灌流狀態（hypoperfusion）是影響估計值最常見的原因。不過因為科技的精進，這方面的問題已經漸有改善
D. 手術燈所發射的可見光，也會影響到血液氧氣飽和度的估計值，因此使用時必須避免強光照射

正確答案：A. 因為血氧飽和濃度也會受到血中二氧化碳濃度的影響，因此脈搏血氧飽和度分析也可用以監測通氣量（ventilation）是否足夠